Clinical trial exclusion criterion:
Subjects with a history of difficulty in providing blood samples

Entity relations:
- Has_temporal("difficulty in providing blood samples", "history")